Clinical trial exclusion criterion:
Coagulopathy or taking anticoagulants responsible an INR> 1.3 or a platelet count <75,000 per microL,

Annotated entities:
- Condition: "Coagulopathy"
- Drug: "anticoagulants"
- Measurement: "INR"
- Value: "> 1.3"
- Measurement: "platelet count"
- Value: "<75,000 per microL"
- Non-representable: "responsible an"